Describe PWMScan

PWMScan is a fast web-based tool to scan server- resident genomes for matches to a user-supplied PWM or transcription factor binding site model from a public database.